¿A qué edad se desarrolla la identidad de género?:
1. Poco después de nacer.
2. Entre los 2 y los 4 años.
3. Entre los 5 y los 7 años.
4. Entre los 13 y los 14 años.
5. En la pubertad.

Respuesta correcta: 2. Entre los 2 y los 4 años.